Have a CD4 cell count of 50 cells/mm3or less

The above is a clinical trial exclusion criterion. Annotated with entity spans:
Have a [Measurement: CD4 cell count] of [Value: 50 cells/mm3or less]